Clinical trial exclusion criterion:
10. Lipid lowering agents: gemfibrozil

Annotated entities:
- Parsing_Error: "10."
- Drug: "gemfibrozil"